Clinical trial exclusion criterion:
Subjects with a history of hypercoagulopathy, deep vein thrombosis (DVT), pulmonary embolism

Entity relations:
- Subsumes("deep vein thrombosis", "DVT")
- OR("hypercoagulopathy", "deep vein thrombosis", "pulmonary embolism")